Clinical trial exclusion criterion:
Cardiovascular disease Clinically relevant ventricular tachycardia or ventricular fibrillation, 3rd degree AV block or Torsades de Pointes or treatment with antiarrhythmic drugs. Percutaneous coronary intervention within the past 6 months. Any of the following within the past 6 months: myocardial infarction (MI), coronary artery bypass surgery; unstable angina; or stroke.

Entity relations:
- AND("treatment", "antiarrhythmic drugs")
- Has_temporal("Percutaneous coronary intervention", "within the past 6 months")
- Has_qualifier("ventricular tachycardia", "Clinically relevant")
- Has_temporal("myocardial infarction (MI)", "within the past 6 months")
- Subsumes("Cardiovascular disease", "ventricular tachycardia")
- OR("ventricular tachycardia", "3rd degree AV block", "ventricular fibrillation", "treatment", "Torsades de Pointes")
- OR("ventricular tachycardia", "Percutaneous coronary intervention", "myocardial infarction (MI)")
- OR("myocardial infarction (MI)", "stroke", "coronary artery bypass surgery", "unstable angina")